Clinical trial exclusion criterion:
Has any progressive form of MS

Annotated entities:
- Condition: "MS"
- Qualifier: "progressive"